Clinical trial inclusion criterion:
Age of onset of first episode = 50 years with up to three depressive episodes;

Annotated entities:
- Condition: "onset of first episode"
- Person: "Age"
- Value: "= 50 years"
- Multiplier: "three"
- Condition: "depressive episodes"